Clinical trial exclusion criterion:
History of allergy or idiosyncratic reaction to diltiazem

Entity relations:
- AND("allergy", "diltiazem")
- OR("allergy", "idiosyncratic reaction")